Acude al domicilio de Juan de 20 años que ha sufrido un traumatismo craneoencefálico tras un accidente de tráfico. La madre le informa de que, desde entonces Juan no es capaz de atender “a dos cosas” al mismo tiempo. ¿Qué tipo de atención tiene afectada?
1. Atención dividida.
2. Atención alternante.
3. Atención selectiva.
4. Atención focalizada.

Respuesta correcta: 1. Atención dividida.